Known major fetal structural or chromosomal abnormality.

The above is a clinical trial exclusion criterion. Annotated with entity spans:
Known [Qualifier: major] [Condition: fetal structural] or [Condition: chromosomal abnormality].